除了遺傳性小圓球症（hereditary spherocytosis）外，microspherocyte最常在下列何種疾病的血液抹片中觀察到？
A. 輸血後溶血反應
B. 自體免疫溶血性貧血
C. 重度燒傷
D. 血症

正確答案：B. 自體免疫溶血性貧血